Body Mass Index =39.9 kg/m2

The above is a clinical trial exclusion criterion. Annotated with entity spans:
[Measurement: Body Mass Index] [Value: =39.9 kg/m2]